Clinical trial inclusion criterion:
Sensation of anorectal obstruction/blockage for =25% of defecations

Annotated entities:
- Condition: "defecations"
- Multiplier: "=25%"
- Condition: "Sensation of anorectal obstruction"
- Condition: "Sensation of anorectal blockage"